以一群健康的80歲老人與一群健康的20歲年輕人相比，下列何者在老人組最不會下降？
A. 運動時可達到的最快心跳速率
B. 動脈血氧分壓
C. 腎絲球過濾率（glomerular filtration rate）
D. 血中胰島素（insulin）濃度

正確答案：D. 血中胰島素（insulin）濃度